當眼房水（aqueous humor）引流路徑異常，會導致眼內壓升高，若不治療可能損害視神經而引起失明，此常見之眼科疾病為：
A. 青光眼（glaucoma）
B. 白內障（cataract）
C. 視乳突水腫（papilledema）
D. 視網膜剝離（retinal detachment）

正確答案：A. 青光眼（glaucoma）